Clinical trial exclusion criterion:
contra-indications of radiotherapy

Annotated entities:
- Procedure: "radiotherapy"
- Condition: "contra-indications"